= 50 years and in postmenopausal state > 1 year

The above is a clinical trial inclusion criterion. Annotated with entity spans:
[Value: = 50] [Person: years] and in [Observation: postmenopausal state] [Temporal: > 1 year]